Ongoing treatment with inotropic drugs (not norepinephrine)

The above is a clinical trial exclusion criterion. Annotated with entity spans:
[Temporal: Ongoing] [Procedure: treatment] with [Drug: inotropic drugs] ([Negation: not] [Drug: norepinephrine])